Clinical trial exclusion criterion:
Non-compliant with blood-letting

Annotated entities:
- Condition: "Non-compliant"
- Procedure: "blood-letting"
- Non-query-able: "Non-compliant"